下列何種醣蛋白變異與肌肉侵犯型膀胱癌最有密切關連？
A. p21
B. p53
C. p16
D. p26

正確答案：B. p53